Clinical trial exclusion criterion:
Patients with coagulopathy or under anti-coagulation therapy.

Annotated entities:
- Condition: "coagulopathy"
- Procedure: "anti-coagulation therapy"